Clinical trial exclusion criterion:
Subject had any previous left atrial ablation.

Annotated entities:
- Procedure: "atrial ablation"
- Qualifier: "left"